最不可能引起細菌性心內膜炎的疾病是：
A. 心房中隔缺損（atrial septal defect）
B. 心室中隔缺損（ventricular septal defect）
C. 開放性動脈導管（patent ductus arteriosus）
D. 二尖瓣脫垂（mitral valve prolapse）

正確答案：A. 心房中隔缺損（atrial septal defect）